Las enzimas alostéricas se caracterizan porque:
1. Siguen una cinética sigmoidea.
2. Siguen una cinética de Michaelis-Menten.
3. Carecen de estructura cuaternaria.
4. El sustrato se une al centro alostérico en lugar de al centro catalítico.

Respuesta correcta: 1. Siguen una cinética sigmoidea.